Clinical trial exclusion criterion:
Platelet count <100,000/mm3

Annotated entities:
- Measurement: "Platelet count"
- Value: "<100,000/mm3"